Clinical trial inclusion criterion:
ASA (american society of anesthesiologists) class 1-3

Annotated entities:
- Measurement: "ASA class"
- Value: "1-3"
- Measurement: "american society of anesthesiologists"